一位末期腎衰竭病人想要了解血液透析和連續性可攜帶式腹膜透析（CAPD）的差別，以考慮她適合那種治療方式。有關這兩種治療方式的敘述，下列那一項是最不正確？
A. 血液透析對於小分子的清除率比較好
B. 血液透析有較多的血行性感染
C. CAPD 在執行上比較沒有立即性的危險
D. CAPD 發生心臟衰竭的機會較少

正確答案：D. CAPD 發生心臟衰竭的機會較少